一位 50 歲男性患者，因持續性左胸痛 2 天而前來就診，其左胸痛隨患者深吸氣而更痛，患者最有可能罹患下列何種疾病？
A. 結核性肋膜炎
B. 心肌梗塞
C. 撕裂性主動脈瘤
D. 間質性肺病

正確答案：A. 結核性肋膜炎